病人上臂骨折後，手腕無法伸展，最可能是下列何者受傷所造成？
A. 正中神經
B. 腋神經
C. 尺神經
D. 橈神經

正確答案：D. 橈神經